¿Cuál de las siguientes afirmaciones acerca de la unión y liberación del oxígeno por la hemoglobina es correcta?
1. Por unión al oxígeno, el hierro del grupo protéstico hemo es oxidado pasando de Fe2+ a Fe3+.
2. La disminución del pH y un aumento de la concentración de BPG (2,3 bis fosfoglicerato) favorecen la liberación de oxígeno por la hemoglobina.
3. Una concentración elevada de 2, 3 bis fosfoglicerato en los eritrocitos favorece la unión de oxígeno por la hemoglobina.
4. La unión de oxígeno a cualquiera de los cuatro “hemos” ocurre independientemente de los otros tres.
5. La unión de la hemoglobina al oxígeno sigue una cinética hiperbólica.

Respuesta correcta: 2. La disminución del pH y un aumento de la concentración de BPG (2,3 bis fosfoglicerato) favorecen la liberación de oxígeno por la hemoglobina.